Clinical trial inclusion criterion:
Capable of the completion of bronchoscopy, alveolar lavage, pulmonary function testing etc;

Annotated entities:
- Post-eligibility: "Capable of the completion of bronchoscopy, alveolar lavage, pulmonary function testing etc"